Pregnant/breast-feeding women

The above is a clinical trial exclusion criterion. Annotated with entity spans:
[Condition: Pregnant]/[Condition: breast-feeding] [Person: women]